Roberto presenta Deterioro de la Integridad Tisular en el miembro inferior derecho. Su enfermera de familia ha reflejado en su Historia Clínica Informatizada: “Curación de herida: por segunda intención”. ¿Qué significa este resultado NOC?:
1. Indemnidad estructural y función fisiológica normal de la piel y las membranas mucosas.
2. Magnitud de regeneración de células y tejidos posterior a un cierre intencionado.
3. Magnitud de regeneración de células y tejidos en una herida abierta.
4. Magnitud de la funcionalidad del tejido en un cierre secundario.

Respuesta correcta: 3. Magnitud de regeneración de células y tejidos en una herida abierta.